Clinical trial inclusion criterion:
Available at school for at least the first pharyngeal swab and willing to comply with study procedures

Entity relations:
- Has_mood("comply with study procedures", "willing to")
- Has_multiplier("pharyngeal swab", "first")